某新兵訓練中心爆發多名新兵發燒、頭痛、噁吐、理學檢查為頸部僵硬、出血性皮疹，腦脊髓液染色為格蘭氏陰性雙球菌，下列敘述何者錯誤？
A. 病人必須採負壓隔離（空氣隔離防護措施）
B. 該病原菌是Neisseria meningitidis
C. 抗生素投藥24小時後，一般病人即不具有傳染性
D. 治療藥物為penicillin或ceftriaxone

正確答案：A. 病人必須採負壓隔離（空氣隔離防護措施）